小腦的 climbing fibers 主要來自何處？
A. pontine nuclei
B. inferior olivary nuclei
C. cerebral cortex
D. vestibular nuclei

正確答案：B. inferior olivary nuclei